Clinical trial inclusion criterion:
ASA(American Society of Anesthesiologists) physical status class I or II

Entity relations:
- Subsumes("ASA physical status class", "American Society of Anesthesiologists")
- Has_value("ASA physical status class", "I or II")